Clinical trial inclusion criteria:
Patients with hepatocirrhosis: according to the standard of child- pugh, liver functions to achieve class A or B patients, Including C class patients but can achieve B class after treatment

Annotated entities:
- Condition: "hepatocirrhosis"